Clinical trial inclusion criterion:
Both partners plan on remaining in Montreal for at least 1 year

Annotated entities:
- Observation: "remaining in Montreal"
- Multiplier: "for at least 1 year"
- Mood: "plan on"